一車禍受傷的病人，右側身體腰部以下喪失痛覺及冷熱覺，但仍有觸覺及震動覺（vibration），則此病人最可能的受傷位置為：
A. 左側 lumbar spinal cord 之 anterolateral part
B. 右側 lumbar spinal cord 之 anterolateral part
C. 左側 lumbar spinal cord 之 dorsal part
D. 右側 lumbar spinal cord 之 dorsal part

正確答案：A. 左側 lumbar spinal cord 之 anterolateral part